What does osanetant and talnetant have in common?

Osanetant and talnetant are selective NK3 antagonists. Preclinical and Phase II clinical results of osanetant and talnetant in schizophrenic patients have indicated that NK(3) antagonists may provide significant improvement of the positive symptoms and cognitive impairment associated with this disorder.